Clinical trial inclusion criterion:
No mediastinal or celiac, or suspected metastatic lymph nodes by EUS,

Annotated entities:
- Qualifier: "metastatic"
- Qualifier: "celiac"
- Qualifier: "mediastinal"
- Condition: "lymph nodes"
- Procedure: "EUS"
- Negation: "No"